抽搐性癲癇重積狀態（convulsive status epilepticus）可造成患者血液中何種化學物質增加而導致心律不整？
A. 乙醯膽鹼（acetylcholine）
B. 兒茶酚胺（catecholamine）
C. 血清素（serotonin）
D. 麩胺酸（glutamate）

正確答案：B. 兒茶酚胺（catecholamine）